Unaware of HIV status at enrollment in follow-up cohort

The above is a clinical trial inclusion criterion. Annotated with entity spans:
[Observation: Unaware of HIV status] [Temporal: at enrollment in follow-up cohort]